Clinical trial inclusion criterion:
Pregnant women with APS diagnosed according to the revised classification criteria for APS in 2006 in Sydney, Australia

Entity relations:
- Has_qualifier("APS", "revised classification criteria for APS in 2006 in Sydney, Australia")